神經的損傷依據Sunderland的分類可以分為幾類？
A. 三
B. 四
C. 五
D. 六

正確答案：D. 六